Clinical trial exclusion criterion:
Presenting an acute endodontic/periodontal lesion in the neighboring areas to the implant site.

Entity relations:
- OR("periodontal lesion", "lesion endodontic")